關於歐氏症（Osgood-Schlatter disease）的敘述，下列何者正確？
A. 病變處之骨頭可能會有碎裂（fragmentation）現象
B. 病變處常位於髕骨與髕骨肌腱交接處
C. 不可使用非類固醇消炎止痛劑
D. 通常需手術治療

正確答案：A. 病變處之骨頭可能會有碎裂（fragmentation）現象